Los superantígenos bacterianos:
1. Tiene una estructura antigénica polimérica.
2. Son procesados por vía endocítica.
3. Se unen a moléculas HLA-B.
4. Pueden activar una gran diversidad de linfocitos.

Respuesta correcta: 4. Pueden activar una gran diversidad de linfocitos.